Clinical trial exclusion criterion:
Pre-existing dementia

Entity relations:
- Has_temporal("dementia", "Pre-existing")